Lack of the patient's consent for the trial participation, feeding tube insertion or epidural analgesia

The above is a clinical trial exclusion criterion. Annotated with entity spans:
[Informed_consent: Lack of the patient's consent for the trial participation, feeding tube insertion or epidural analgesia]